肝門靜脈高壓（portal hypertension）最不可能造成下列何種現象？
A. 痔瘡
B. 食道靜脈曲張
C. 下肢靜脈曲張
D. 脾靜脈壓力升高

正確答案：C. 下肢靜脈曲張